下列有關異卵雙胞胎的敘述，何者正確？
A. 只有在雙胞胎的性別相同時，此對雙胞胎才會為雙絨毛膜（dichorionic）及單羊膜（monoamniotic）雙胞胎
B. 不管雙胞胎的性別是否相同，此對雙胞胎必為雙絨毛膜及單羊膜雙胞胎
C. 假如雙胞胎為連體嬰，此對雙胞胎為單絨毛膜（monochorionic）及單羊膜雙胞胎
D. 不管雙胞胎的性別是否相同，此對雙胞胎必為雙絨毛膜及雙羊膜（diamniotic）雙胞胎

正確答案：D. 不管雙胞胎的性別是否相同，此對雙胞胎必為雙絨毛膜及雙羊膜（diamniotic）雙胞胎